Clinical trial exclusion criteria:
Children who are uncooperative and difficult to manage, have major systemic diseases, or are on long-term medication will be excluded.

Annotated entities:
- Condition: "uncooperative"
- Observation: "difficult to manage"
- Subjective_judgement: "major"
- Condition: "systemic diseases"
- Qualifier: "major"
- Temporal: "long-term"
- Drug: "medication"